大腸桿菌 cAMP receptor protein 與 lac 操縱子（operon）DNA 結合後，可產生下列何種效應？
A. 幫助 RNA 聚合酶與 lac 啟動子（promoter）結合的效應
B. 可抑制 lac 操縱子的活性
C. 可避免抑制子（repressor）與 lac 的操縱基因（operator）結合
D. 在葡萄糖的存在下始能與 lac 操縱子結合

正確答案：A. 幫助 RNA 聚合酶與 lac 啟動子（promoter）結合的效應